Clinical trial exclusion criterion:
7. Unwilling or unable to cease using the following medications during the study period: Topical ocular cyclosporine (e.g. Restasis®), anti-histamines, antipsychotics, or eye gels.

Annotated entities:
- Parsing_Error: "7."
- Post-eligibility: "Unwilling or unable"
- Non-query-able: "Unwilling or unable"
- Drug: "Topical ocular cyclosporine"
- Drug: "Restasis®"
- Drug: "anti-histamines"
- Drug: "antipsychotics"
- Drug: "eye gels"
- Temporal: "during the study period"
- Reference_point: "study period"